¿Cuál de los hipoglucemiantes reseñados inhibe el contransportador renal de sodio y glucosa?:
1. Dapagliflozina.
2. Exenatida.
3. Nateglinida.
4. Sitagliptina.

Respuesta correcta: 1. Dapagliflozina.